關於憂鬱症患者的睡眠變化，下列何者最不常見？
A. 睡眠總時數減少
B. 快速動眼期睡眠（REM sleep）的量增加
C. 慢波睡眠（slow wave sleep）的量減少
D. 出現第一個快速動眼期睡眠的時間（REM latency）延後發生

正確答案：D. 出現第一個快速動眼期睡眠的時間（REM latency）延後發生